Clinical trial exclusion criteria:
age <45 or >80
allergies to medications used in the study
history of renal diseases, a coagulation abnormality, a hepatic disease, or drug abuse
definite radiographic evidence of osteoarthritis of the glenohumeral joint
inflammatory arthritis including rheumatoid arthritis
a history of acute trauma
systemic conditions associated with chronic pain
a history of infection
an inability to understand the questionnaires

Annotated entities:
- Person: "age"
- Value: "<45 or >80"
- Condition: "allergies"
- Drug: "medications"
- Qualifier: "used in the study"
- Temporal: "history"
- Condition: "renal diseases"
- Condition: "coagulation abnormality"
- Condition: "hepatic disease"
- Condition: "drug abuse"
- Mood: "radiographic evidence"
- Condition: "osteoarthritis"
- Qualifier: "glenohumeral joint"
- Procedure: "radiographic"
- Qualifier: "definite"
- Condition: "inflammatory arthritis"
- Condition: "rheumatoid arthritis"
- Condition: "acute trauma"
- Temporal: "history"
- Condition: "systemic conditions"
- Qualifier: "associated with chronic pain"
- Condition: "chronic pain"
- Temporal: "history"
- Condition: "infection"
- Observation: "inability to understand the questionnaires"